Must have received front line chemotherapy. No upper limit for the number of prior therapies

The above is a clinical trial inclusion criterion. Annotated with entity spans:
Must have received [Qualifier: front line] [Procedure: chemotherapy]. [Not_a_criteria: No upper limit for the number of prior therapies]